下列有關泌尿上皮癌（urothelial cancer）的敘述，何者正確？
A. 腺癌（adenocarcinoma）約占 90%
B. 慢性發炎是產生腺癌的最主要成因
C. 臍尿管（urachus）長出的癌症多是腺癌
D. 以腎臟發生的機率最多

正確答案：C. 臍尿管（urachus）長出的癌症多是腺癌